Treated by a single NA (lamivudine, adefovir, entecavir or tenofovir) for 6 months to 5 years

The above is a clinical trial inclusion criterion. Annotated with entity spans:
[Procedure: Treated] by a [Multiplier: single] [Drug: NA] ([Drug: lamivudine], [Drug: adefovir], [Drug: entecavir] or [Drug: tenofovir]) [Temporal: for 6 months to 5 years]